Clinical trial exclusion criterion:
Patient with known liver disease or renal disease

Entity relations:
- OR("liver disease", "renal disease")